Clinical trial inclusion criteria:
Healthy adults 18-45 years of age
Non-smoking
Non-pregnant (post-menopausal, surgically sterile or using effective contraceptive measures)
Body mass index (BMI) less than or equal to 32
Medically healthy on the basis of medical history and physical examination
Hemoglobin > or = to 11.5g/dL
Completion of the screening process within 28 days prior to dosing
Provision of voluntary written informed consent

Annotated entities:
- Value: "18-45 years of age"
- Condition: "Healthy"
- Person: "adults"
- Person: "of age"
- Condition: "smoking"
- Negation: "Non"
- Condition: "pregnant"
- Negation: "Non"
- Condition: "surgically sterile"
- Procedure: "surgically"
- Condition: "post-menopausal"
- Procedure: "contraceptive measures"
- Qualifier: "effective"
- Undefined_semantics: "effective"
- Measurement: "Body mass index (BMI)"
- Value: "less than or equal to 32"
- Temporal: "medical history"
- Procedure: "physical examination"
- Condition: "Medically healthy"
- Measurement: "Hemoglobin"
- Value: "> or = to 11.5g/dL"
- Temporal: "within 28 days prior to dosing"
- Reference_point: "dosing"
- Procedure: "screening process"
- Post-eligibility: "Provision of voluntary written informed consent"